Clinical trial inclusion criterion:
Symptomatic patients with heart failure (men and women) aged >18 years,

Annotated entities:
- Condition: "heart failure"
- Person: "men"
- Person: "women"
- Person: "aged"
- Value: ">18 years"
- Condition: "Symptomatic"